Preoperative history of schizophrenia, epilepsy, parkinsonism or myasthenia gravis;

The above is a clinical trial exclusion criterion. Annotated with entity spans:
[Temporal: Preoperative] [Temporal: history] of [Condition: schizophrenia], [Condition: epilepsy], [Condition: parkinsonism] or [Condition: myasthenia gravis];